Clinical trial exclusion criterion:
5. Agents affecting gastric emptying (Motilium®, Prandase®, Victoza®, Byetta® and Symlin®) as well as oral anti-diabetic agents (Metformin, SGLT-2 inhibitors and DPP-4 inhibitors) if not at a stable dose for 3 months. Otherwise, these medications are acceptable and will be kept stable during the entire protocol.

Annotated entities:
- Parsing_Error: "5."
- Drug: "Agents affecting gastric emptying"
- Undefined_semantics: "Agents affecting gastric emptying"
- Drug: "Motilium"
- Drug: "Prandase"
- Drug: "Victoza"
- Drug: "Byetta"
- Drug: "Symlin"
- Grammar_Error: "and"
- Drug: "oral anti-diabetic agents"
- Drug: "Metformin"
- Drug: "SGLT-2 inhibitors"
- Drug: "DPP-4 inhibitors"
- Grammar_Error: "and"
- Qualifier: "stable dose"
- Temporal: "for 3 months"
- Negation: "not"
- Parsing_Error: "Otherwise, these medications are acceptable and will be kept stable during the entire protocol."